在社區為導向的基層醫療保健實施的過程，下列何者為以公共衛生的觀點所增加的項目？
A. 確認社區健康問題
B. 社區成員參與
C. 需求導向的社區健康照護計畫
D. 追蹤並評估計畫之執行成效

正確答案：B. 社區成員參與